Clinical trial exclusion criterion:
Intracranial hemorrhage in anamnesis

Annotated entities:
- Condition: "Intracranial hemorrhage"
- Procedure: "anamnesis"